關於胰臟癌，下列何者錯誤？
A. 最常見的病理切片診斷為ductal adenocarcinoma
B. 胰臟癌發生的危險因子包括有年紀、家族史、抽菸、慢性胰臟炎等
C. 根據American Joint Committee on Cancer（AJCC）對於胰臟癌所作的分期，T3N0M0與T2N1M0皆是屬於stage IIB
D. 胰臟頭部的癌症，可以考慮以pancreaticoduodenectomy來切除之

正確答案：C. 根據American Joint Committee on Cancer（AJCC）對於胰臟癌所作的分期，T3N0M0與T2N1M0皆是屬於stage IIB